Clinical trial inclusion criterion:
Patients aged 7 years and older must have provided written assent accompanied by written informed consent from patient's representative

Entity relations:
- Has_value("aged", "7 years and older")